Clinical trial exclusion criterion:
life expectancy <1 year

Entity relations:
- Has_value("life expectancy", "<1 year")